Clinical trial exclusion criterion:
Follicle stimulating hormone > 20 IU/L

Annotated entities:
- Measurement: "Follicle stimulating hormone"
- Value: "> 20 IU/L"